List SLC25A46-related pathologies

The mitochondrial protein SLC25A46 has been identified as a novel pathogenic cause in a wide spectrum of neurological diseases, including inherited optic atrophy, Charcot-Marie-Tooth type 2, Leigh syndrome, progressive myoclonic ataxia, lethal congenital pontocerebellar hypoplasia and lethal neuropathology